Clinical trial exclusion criterion:
Left ventricular hypertrophy by echocardiography or ECG

Entity relations:
- Subsumes("echocardiography", "ECG")
- AND("echocardiography", "Left ventricular hypertrophy")